一位住在大學宿舍的 25 歲大學生，從昨日開始眼睛變紅，怕光且右眼容易流淚。宿舍其他人並未發現有紅眼睛。幾天前，他曾患有喉嚨痛及輕度咳嗽。理學檢查雙眼視力為 20/50，並呈現廣泛性發紅及流淚，被懷疑是結膜炎。下列有關結膜炎的鑑別診斷，何者錯誤？
A. 淋菌性結膜炎會表現有嚴重超急性化膿性分泌物
B. 腺病毒（adenovirus）結膜炎一般先由一隻眼開始，再擴散至另一隻眼
C. 耳朵前出現腫大的淋巴結節是過敏性結膜炎的病徵
D. 局部使用抗生素，抗病毒藥物及其防腐劑亦可引起結膜炎

正確答案：C. 耳朵前出現腫大的淋巴結節是過敏性結膜炎的病徵